Erythropoiesis-stimulating agents (ESA) administered within 4 weeks prior to Screening

The above is a clinical trial exclusion criterion. Annotated with entity spans:
[Drug: Erythropoiesis-stimulating agents] ([Drug: ESA]) administered [Temporal: within 4 weeks prior to Screening]